Chronic Insomnia disorder criteria according to the criteria of DMS- V ( American Psychiatric Association, 2013) and insomnia severity index > 15

The above is a clinical trial inclusion criterion. Annotated with entity spans:
[Condition: Chronic Insomnia disorder] criteria according to the [Qualifier: criteria of DMS- V] ( American Psychiatric Association, 2013) and [Measurement: insomnia severity index] [Value: > 15]